在高度蛔蟲感染流行區，下列何種年齡層是蛔蟲（Ascaris lumbricoides）感染的高危險族群？
A. 1～4 歲
B. 5～9 歲
C. 10～15 歲
D. 15 歲以上

正確答案：B. 5～9 歲